Clinical trial exclusion criterion:
Any disorder of coagulation

Annotated entities:
- Condition: "disorder of coagulation"